Clinical trial exclusion criterion:
Subjects with diseases of the central nervous system that may impact the assessment of the psychotic symptoms as per investigator's opinion.

Annotated entities:
- Post-eligibility: "Subjects with diseases of the central nervous system that may impact the assessment of the psychotic symptoms as per investigator's opinion."